Heart failure NYHA III to IV

The above is a clinical trial exclusion criterion. Annotated with entity spans:
[Condition: Heart failure] [Measurement: NYHA] [Value: III to IV]